El criterio fundamental para la elección de las intervenciones en un plan de enfermería, es que éstas sean:
1. Alcanzables con los recursos disponibles.
2. Las recomendadas en el plan de cuidados estandarizado.
3. Eficaces con independencia de los criterios de la persona.
4. Basadas exclusivamente en el conocimiento de la enfermera.
5. Todas son correctas.

Respuesta correcta: 1. Alcanzables con los recursos disponibles.